hospitalized for heart failure in last 12 months

The above is a clinical trial inclusion criterion. Annotated with entity spans:
[Observation: hospitalized] for [Condition: heart failure] [Temporal: in last 12 months]